internal, neurologic or psychiatric disease that interfere with protocol compliance including current heavy smoking (>20 cigarettes per day), inability to perform 6 min walk test.

The above is a clinical trial exclusion criterion. Annotated with entity spans:
[Condition: internal], [Condition: neurologic] or [Condition: psychiatric disease] that interfere with protocol compliance including current [Qualifier: heavy] [Observation: smoking] ([Multiplier: >20 cigarettes per day]), [Negation: inability] to perform [Procedure: 6 min walk test].